Functional Class II and III by the New York Heart Association (NYHA)

The above is a clinical trial inclusion criterion. Annotated with entity spans:
Functional [Value: Class II and III] by the [Measurement: New York Heart Association (NYHA)]